Clinical trial exclusion criterion:
Renal of hepatic insufficiency

Annotated entities:
- Condition: "hepatic insufficiency"
- Condition: "Renal insufficiency"